一位 93 歲住在安養中心的男性病患，長期臥床，最近三天發現全身虛弱，食慾差而送醫院處理，在急診室檢查的結果為 WBC 9,800/mm3，Hb 13.1 g/dL，BUN 30 mg/dL，creatinine 1.3 mg/dL，Na 116 mEq/L， 3 mEq/L，glucose 91 mg/dL，CRP 0.18 mg/dL。最可能的診斷為何？
A. 吸入性肺炎（aspiration pneumonia）
B. 肺栓塞（pulmonary embolism）
C. 急性胰臟炎（acute pancreatitis）
D. 低血鈉（hyponatremia）

正確答案：D. 低血鈉（hyponatremia）